Clinical trial exclusion criterion:
Absence of documentation of negative hepatitis B serologies, absence of completion of treatment for chronic hepatitis B, or absence of suppressive antiviral treatment

Entity relations:
- Has_value("hepatitis B serologies", "negative")
- Has_negation("hepatitis B serologies", "Absence of")
- AND("treatment", "chronic hepatitis B")
- Has_negation("suppressive antiviral treatment", "absence")
- Has_negation("chronic hepatitis B", "absence of")
- OR("hepatitis B serologies", "suppressive antiviral treatment", "chronic hepatitis B")